Clinical trial exclusion criterion:
Glucocorticosteroid injection to the diseased achilles tendon within the last 6 months.

Entity relations:
- AND("injection", "Glucocorticosteroid")
- AND("injection", "diseased achilles tendon")
- Has_temporal("injection", "within the last 6 months")